Clinical trial exclusion criterion:
drug or alcohol abuse

Annotated entities:
- Condition: "alcohol abuse"
- Condition: "drug abuse"